congestive heart failure New York Heart Association (NYHA) III and IV

The above is a clinical trial exclusion criterion. Annotated with entity spans:
[Condition: congestive heart failure] [Measurement: New York Heart Association] ([Measurement: NYHA]) [Value: III and IV]